Clinical trial exclusion criterion:
Death imminent

Entity relations:
- Has_temporal("Death", "imminent")